Clinical trial inclusion criterion:
Normal uterine cavity on ultrasound exam (e.g., no presence of hydrosalpinx)

Annotated entities:
- Procedure: "ultrasound exam"
- Observation: "Normal uterine cavity"
- Negation: "no presence of"
- Condition: "hydrosalpinx"